一名 40 歲女性，檢查顯示子宮體後壁有一個腫瘤，並已侵入子宮肌層。顯微鏡下可見腫瘤是由單一型態的細胞組成，沒有絨毛（chorionic villus）的存在。這些腫瘤細胞具有單核及豐富細胞質。免疫組織化學染色發現這些細胞有人類胎盤催乳質（human placental lactogen）表現。最可能的診斷是：
A. 子宮內膜間質細胞肉瘤（Endometrial stromal sarcoma）
B. 絨毛膜癌（Choriocarcinoma）
C. 著床處滋養細胞腫瘤（Placental site trophoblastic tumor）
D. 侵入性胎塊（Invasive mole）

正確答案：C. 著床處滋養細胞腫瘤（Placental site trophoblastic tumor）